advanced chronic disease that would not allow the patient to complete the treatment or follow-up or attend visits

The above is a clinical trial exclusion criterion. Annotated with entity spans:
a[Non-query-able: dvanced chronic disease that would not allow the patient to complete the treatment or follow-up or attend visits]